Clinical trial inclusion criterion:
CPPE along with evidence of septated pleural effusion on pleural ultrasonography and/or chest CT scan

Entity relations:
- Has_mood("septated pleural effusion", "evidence of")
- AND("septated pleural effusion", "pleural ultrasonography")
- OR("pleural ultrasonography", "chest CT scan")